Clinical trial inclusion criterion:
Male and female individuals between ages of 18 to 70 years old

Annotated entities:
- Person: "ages"
- Value: "between 18 to 70 years old"